下列何者位於手腕背側第六個伸肌腱腔室內（extensor compartment）？
A. 伸食指肌（extensor indicis proprius）
B. 伸拇長肌（extensor pollicis longus）
C. 尺側伸腕肌（extensor carpi ulnaris）
D. 伸小指肌（extensor digiti minimi）

正確答案：C. 尺側伸腕肌（extensor carpi ulnaris）